En la bronquitis crónica es característica la:
1. Destrucción de paredes alveolares.
2. Dificultad en el flujo inspiratorio.
3. Disminución del volumen de reserva inspiratorio.
4. Elevación de la presión hidrostática capilar.
5. Inflamación e hipersecreción mucosa de las vías respiratorias.

Respuesta correcta: 5. Inflamación e hipersecreción mucosa de las vías respiratorias.